Clinical trial inclusion criterion:
Pregnant gestational age >= 28 weeks

Annotated entities:
- Measurement: "gestational age"
- Value: ">= 28 weeks"